下列關於子癇前症（preeclampsia）的敘述，何者正確？
A. 心臟輸出量（cardiac output）減少，周邊血管阻力（peripheral resistance）也減少
B. 心臟輸出量減少，周邊血管阻力增加
C. 心臟輸出量增加，周邊血管阻力也增加
D. 心臟輸出量增加，周邊血管阻力減少

正確答案：B. 心臟輸出量減少，周邊血管阻力增加